關於腸套疊（intussusception），下列何者錯誤？
A. 多發生在 10 歲以上的幼兒
B. 嬰幼兒以原因不明為主
C. 2 歲以下嬰兒，以迴盲套腸為最常見
D. 成年之腸套疊常合併有結腸腫瘤

正確答案：A. 多發生在 10 歲以上的幼兒